Clinical trial exclusion criterion:
contra-indications for regular dental treatment

Annotated entities:
- Condition: "contra-indications"
- Procedure: "regular dental treatment"